Clinical trial exclusion criterion:
History of chronic obstructive pulmonary disease or cor pulmonale, or substantially decreased respiratory reserve, hypoxia, hypercapnia or pre-existing respiratory depression

Entity relations:
- OR("chronic obstructive pulmonary disease", "cor pulmonale,", "decreased respiratory reserve", "hypoxia", "hypercapnia", "respiratory depression")